Clinical trial inclusion criterion:
Failure of index PCI

Annotated entities:
- Procedure: "PCI"
- Temporal: "index"
- Observation: "Failure"